Clinical trial exclusion criterion:
12. Lapatinib

Annotated entities:
- Parsing_Error: "12."
- Drug: "Lapatinib"